下列何者是周全性老年評估（comprehensive geriatric assessment）的對象？
A. 65 歲以上老人
B. 急性功能減退的老人
C. 長期照護機構臥床老人
D. 接受重症治療中的老人

正確答案：B. 急性功能減退的老人